Other severe concurrent illness (e.g. active infection, malignancy).

The above is a clinical trial exclusion criterion. Annotated with entity spans:
Other [Qualifier: severe] [Qualifier: concurrent] [Condition: illness] (e.g. [Condition: active infection], [Condition: malignancy]).